Patients with atrial fibrillation taking any anticoagulant therapy or patients with a history of cardioembolic ischemic stroke or hemorrhagic stroke.

The above is a clinical trial exclusion criterion. Annotated with entity spans:
Patients with [Condition: atrial fibrillation] taking any [Procedure: anticoagulant therapy] or patients with a [Temporal: history of] [Qualifier: cardioembolic] [Condition: ischemic stroke] or [Condition: hemorrhagic stroke].